Postoperative TNM(primary tumor,regional nodes,metastasis) staging III~IV, positive surgical margin.

The above is a clinical trial inclusion criterion. Annotated with entity spans:
[Qualifier: Postoperative] [Measurement: TNM](primary tumor,regional nodes,metastasis) staging [Value: III~IV,] [Value: positive] [Measurement: surgical margin].